Clinical trial exclusion criterion:
Hypersensitivity to everolimus, sirolimus or excipient

Entity relations:
- AND("Hypersensitivity", "everolimus")
- OR("everolimus", "excipient", "sirolimus")